Clinical trial inclusion criterion:
Child-Pugh score <12

Entity relations:
- Has_value("Child-Pugh score", "<12")